Recto-vaginal fistula

The above is a clinical trial exclusion criterion. Annotated with entity spans:
[Condition: Recto-vaginal fistula]